25歲女大學生，主訴半年無月經，病患主訴課業壓力大，外觀體毛細，皮膚偏黃，身高162公分，體重35公斤，關於此病患，下列敘述何者錯誤？
A. 血中FSH及E2可見hypogonadotropic hypogonadism
B. 必要時可照會精神科
C. 使用clomiphene citrate可恢復月經
D. 增重對於月經恢復有幫忙

正確答案：C. 使用clomiphene citrate可恢復月經